下列何者不是結核病（Tuberculosis）之特性？
A. 結核病由結核分枝桿菌（Mycobacterium tuberculosis）所引起
B. 兒童第一次感染大多數無症狀
C. 空曠的地方容易造成肺結核感染
D. 接種 BCG 疫苗可使未感染者產生不同程度之防護力

正確答案：C. 空曠的地方容易造成肺結核感染